American Society of Anesthesiologists Physical Status (ASA PS) score of I or II.

The above is a clinical trial inclusion criterion. Annotated with entity spans:
[Measurement: American Society of Anesthesiologists Physical Status] ([Measurement: ASA PS]) score of [Value: I or II].